Clinical trial inclusion criterion:
All patients with esophageal cancer who are deemed candidates for minimally invasive robot assisted Ivor Lewis esophagogastrectomy.

Annotated entities:
- Condition: "esophageal cancer"
- Observation: "candidates"
- Qualifier: "minimally invasive"
- Qualifier: "robot assisted"
- Qualifier: "Ivor Lewis"
- Procedure: "esophagogastrectomy"